Super-SILAC is a method used in quantitative proteomics. What is the super-SILAC mix?
(SILAC: Stable Isotopic labelling by aminoacids in cell culture)

The Super-SILAC mix consists of the combination of multiple SILAC-labeled cell lines.